Ongoing therapy with any of the following: Systemic corticosteroids. Short course less than or equal to 21 days of corticosteroids is allowed; Systemic chemotherapeutic agents; Nephrotoxic systemic agents, including aminoglycosides, amphotericin B, cidofovir, cisplatin, foscarnet, pentamidine; Immunomodulatory treatments including Interleukin-2; Investigational agents

The above is a clinical trial exclusion criterion. Annotated with entity spans:
[Temporal: Ongoing] [Procedure: therapy] with any of the following: [Drug: Systemic corticosteroids]. [Multiplier: Short course] [Multiplier: less than or equal to 21 days] of [Condition: corticosteroids] [Negation: is allowed]; [Drug: Systemic chemotherapeutic agents]; [Drug: Nephrotoxic systemic agents], including [Drug: aminoglycosides], [Drug: amphotericin B], [Drug: cidofovir], [Drug: cisplatin], [Drug: foscarnet], [Drug: pentamidine]; [Procedure: Immunomodulatory treatments] including [Drug: Interleukin-2]; [Drug: Investigational agents]